下列有關吸入性麻醉氣體的敘述，何者錯誤？
A. 會抑制缺血性肺血管收縮（hypoxic pulmonary vasoconstriction）
B. 會減少病患呼吸時的潮氣容積（tidal volume）
C. 會減少心臟收縮力（myocardial contractility）
D. 藥物代謝主要是透過腎臟進行

正確答案：D. 藥物代謝主要是透過腎臟進行